Una niña de 8 meses cumple criterios de diagnóstico              de           síndrome hemofagocítico/linfohistiocitosis hemofagocítica -fiebre,      hepatoesplenomegalia,     anemia, trombopenia, hipetransaminasemia, aumento de sCD25- y presenta un defecto en la capacidad de degranulación de sus linfocitos (expresión de CD107a). Señale la actitud terapeútica correcta en este caso:
1. Iniciar         rápidamente       tratamiento inmunosupresor y tipaje HLA para la búsqueda de donante (trasplante de progenitores hematopoyéticos).
2. Tratamiento biológico con Daclizumab (antiCD25) como única terapia hasta obtener el diagnóstico molecular de la enfermedad.
3. Tratamiento sintomático y de soporte (transfusión de hematíes y plaquetas) y evitar cualquier fármaco inmunosupresor.
4. Antibioterapia de amplio espectro via iv para el      tratamiento    de     un     eventual microorganismo desencadenante del cuadro de hemofagocitosis.
5. Tratamiento       con       gammaglobulinas intravenosas, a mantener de por vida.

Respuesta correcta: 1. Iniciar         rápidamente       tratamiento inmunosupresor y tipaje HLA para la búsqueda de donante (trasplante de progenitores hematopoyéticos).